一位對稱型低體重（symmetric type small-for-gestational age）新生兒，理學檢查發現其肌肉張力強（hypertonia）、小下巴（micrognathia）、顎裂（cleft palate）、手指成握拳狀（clenched hand），以及腳踝後跟似搖搖椅狀（rocker-bottom feet）。下列何者為其最常合併之心臟異常？
A. 法洛氏四合症（tetralogy of Fallot）
B. 肺動脈狹窄（pulmonary stenosis）
C. 心室中隔缺損（ventricular septal defect）
D. 房室內墊缺損（endocardial cushion defect）

正確答案：C. 心室中隔缺損（ventricular septal defect）